Clinical trial inclusion criterion:
Existence of a contraceptive method for women of reproductive age

Annotated entities:
- Device: "contraceptive"
- Person: "women"
- Value: "reproductive"
- Person: "age"